4. Joint contractures

The above is a clinical trial exclusion criterion. Annotated with entity spans:
[Parsing_Error: 4.] [Condition: Joint contractures]